Clinical trial inclusion criterion:
no pathological HINTS (examination criteria in acute vestibular syndrome)

Annotated entities:
- Negation: "no"
- Condition: "HINTS"
- Qualifier: "pathological"
- Condition: "acute vestibular syndrome"